history of gastric or duodenal ulcers

The above is a clinical trial exclusion criterion. Annotated with entity spans:
history of [Condition: gastric] or [Condition: duodenal ulcers]